下列那一項不是胰臟炎所致的併發症？
A. 胰臟假性囊腫（Pancreatic pseudocyst）
B. 胰臟周圍壞死（Peripancreatic necrosis）
C. 胰臟膿瘍（Pancreatic abscess）
D. 胰管分裂管（Pancreas divisum）

正確答案：D. 胰管分裂管（Pancreas divisum）